Clinical trial exclusion criterion:
Uncontrolled intercurrent illness including, but not limited to, ongoing or active infection, symptomatic congestive heart failure, unstable angina pectoris, cardiac arrhythmia, or psychiatric illness/social situations that would limit compliance with study requirements.

Entity relations:
- Has_temporal("infection", "ongoing")
- Has_qualifier("congestive heart failure", "symptomatic")
- Has_qualifier("intercurrent illness", "Uncontrolled")
- Subsumes("intercurrent illness", "infection")
- OR("ongoing", "active")
- OR("infection", "social situations that would limit compliance with study requirements", "cardiac arrhythmia", "unstable angina pectoris", "congestive heart failure", "psychiatric illness")